在胚胎第七、八週時感染風疹（rubella），病毒可能導致聽障並影響下列何者？
A. 外耳聽道大小
B. 螺旋神經節發育
C. 中耳小骨與韌帶形成
D. 耳廓（auricle）的大小

正確答案：B. 螺旋神經節發育